What genes is implicated in myotonic goats and other  nondystrophic myotonias?

Myotonic goats and other Nondystrophic myotonic myotonias are caused by mutations in either the CLCN1 gene or the SCN4A gene.